Clinical trial inclusion criterion:
Primary tumor must have been diagnosed histologically as either epithelial ovarian cancer, fallopian tube cancer, or primary peritoneal cancer (not borderline or low malignant potential epithelial carcinoma).

Entity relations:
- Has_qualifier("histologically", "Primary tumor")
- AND("histologically", "epithelial ovarian cancer")
- Has_qualifier("epithelial carcinoma", "borderline")
- Has_negation("epithelial carcinoma", "not")
- AND("epithelial ovarian cancer", "epithelial carcinoma")
- OR("epithelial ovarian cancer", "primary peritoneal cancer", "fallopian tube cancer")
- OR("borderline", "low malignant potential")